The formation of which inflammatory molecule is regulated by MAP3K8 (TPL2)?

MAP3K8 (Tpl2) regulates the formation of inflammatory molecule IL-1β